Clinical trial exclusion criterion:
Any debilitating disease prior to the SCI that caused exercise intolerance

Entity relations:
- AND("debilitating disease", "exercise intolerance")
- Has_temporal("debilitating disease", "prior to the SCI")